With a history of mental illness and/or family history of mental illness;

The above is a clinical trial exclusion criterion. Annotated with entity spans:
With a [Temporal: history] of [Condition: mental illness] and/or [Observation: family history] of [Condition: mental illness];